Clinical trial exclusion criterion:
Resting heart rate <45 bpm or >90 bpm at screening.

Entity relations:
- Has_index("at screening", "screening")
- Has_value("Resting heart rate", "<45 bpm")
- Has_temporal("Resting heart rate", "at screening")
- OR("<45 bpm", ">90 bpm")